Clinical trial inclusion criterion:
active bleeding, clinical findings, that in the judgement of the investigator are associated with an increased risk of bleeding

Entity relations:
- Has_temporal("bleeding", "active")
- OR("bleeding", "clinical findings, that in the judgement of the investigator are associated with an increased risk of bleeding")